Clinical trial exclusion criterion:
pregnancy or planning to become pregnant in the next 2 years,

Entity relations:
- Has_mood("pregnant", "planning to become")
- Has_temporal("planning to become", "in the next 2 years")
- OR("pregnancy", "pregnant")